Clinical trial exclusion criterion:
Subject with a history of congenital QT prolongation

Entity relations:
- Has_temporal("congenital QT prolongation", "history of")